List the three main structures of the cytoskeleton.

Fibrillar polymers-actin filaments, microtubules, and intermediate filaments-are major constituents of the cytoskeleton.